Alanine aminotransferase (ALT) or aspartate aminotransferase (AST) > 3 times upper limit of normal (ULN)

The above is a clinical trial exclusion criterion. Annotated with entity spans:
[Measurement: Alanine aminotransferase (ALT)] or [Measurement: aspartate aminotransferase (AST)] [Value: > 3 times upper limit of normal (ULN)]